Clinical trial exclusion criterion:
Confirmed platelet count < the LLN of the evaluating laboratory at Screening or documented at <100,000/µL within the past year on a sample without platelet clumping

Entity relations:
- Has_qualifier("platelet count", "Confirmed")
- Has_temporal("<100,000/µL", "within the past year")
- Has_temporal("< the LLN of the evaluating laboratory", "at Screening")
- Has_value("platelet count", "< the LLN of the evaluating laboratory")
- Has_qualifier("platelet count", "sample without platelet clumping")
- OR("< the LLN of the evaluating laboratory", "<100,000/µL")